Clinical trial inclusion criteria:
Children receiving amoxicilline-clavulanic acid (50-90 mg/kg/day, twice daily) due to acute otitis media or acute sinusitis

Annotated entities:
- Drug: "amoxicilline-clavulanic acid"
- Person: "Children"
- Value: "50-90 mg/kg/day"
- Multiplier: "twice daily"
- Condition: "acute otitis media"
- Condition: "acute sinusitis"